Un endotelio es un epitelio:
1. Simple plano.
2. Estratificado plano.
3. Seudoestratificado.
4. De transición.

Respuesta correcta: 1. Simple plano.